下列何者不會出現於 phenylketonuria 病患的尿液中？
A. Phenylalanine
B. Phenylpyruvate
C. Para-hydroxyphenylpyruvate
D. Phenylacetate

正確答案：C. Para-hydroxyphenylpyruvate